Clinical trial inclusion criterion:
definite unilateral vestibulopathy

Annotated entities:
- Condition: "vestibulopathy"
- Qualifier: "unilateral"